El término isocrático es utilizado en la cromatografía líquida de alta presión (HPLC) cuando:
1. La fase móvil está a temperatura constante.
2. La fase estacionaria está en equilibrio con la fase móvil.
3. La fase móvil consiste en un solvente único con una composición constante.
4. La velocidad del flujo de la fase móvil está regulada.
5. Todas las opciones son correctas.

Respuesta correcta: 3. La fase móvil consiste en un solvente único con una composición constante.